Las HDL:
1. Son ricas en triglicéridos.
2. Carecen de apoproteínas minoritarias.
3. Transportan colesterol de los tejidos al hígado.
4. Se activan por A-III.
5. Transportan ácidos grasos esenciales.

Respuesta correcta: 3. Transportan colesterol de los tejidos al hígado.